下列那一描述，最不適用於致癌物之風險評估？
A. 假設劑量反應有閾值存在
B. 進行不確定分析
C. 考量長期暴露狀況
D. 利用斜率因子計算致癌風險

正確答案：A. 假設劑量反應有閾值存在